50歲男性高血壓患者，本次回診時告訴醫師，有一位自然療法的朋友告訴他「每天吃玉米可以降血壓」，他生活的社區中也有許多人在使用，他解釋高血壓是「熱」的疾病，而玉米是 「冷」的食物。假設吃玉米對此病人健康沒有危害，下列何者是醫師最適當的回應？
A. 「吃玉米不能降血壓，如果你堅持吃玉米，我無法繼續提供治療。」
B. 「你那位朋友有接受過醫學訓練嗎？」
C. 「那就先試吃玉米且暫停降血壓藥，等一個月後，如果血壓仍高，我再開降血壓藥給	 你。」
D. 「藥物可以有效的降血壓，你可以跟玉米一起使用。」

正確答案：D. 「藥物可以有效的降血壓，你可以跟玉米一起使用。」